班氏絲蟲（Wuchereria bancrofti）之患者服用下列何種藥物有助於白天採血檢查微絲蟲（microfilaria）？
A. albendazole
B. diethylcarbamazine
C. praziquantel
D. metronidazole

正確答案：B. diethylcarbamazine